Clinical trial inclusion criterion:
Localized intermediate-risk or high-risk prostate cancer cT3

Annotated entities:
- Qualifier: "high-risk"
- Qualifier: "cT3"
- Qualifier: "intermediate-risk"
- Condition: "prostate cancer"